Clinical trial inclusion criterion:
Be able and willing to learn clean intermittent self catheterization technique

Annotated entities:
- Non-query-able: "Be able and willing to learn clean intermittent self catheterization technique"